Clinical trial inclusion criterion:
All patients that develop septic shock while in the ICU

Annotated entities:
- Condition: "septic shock"
- Temporal: "while in the ICU"
- Reference_point: "in the ICU"